What 3 organs are the sphincter of Oddi associated with?

The sphincter ofoddi is associated with the pancreatic duct, the duodenal crypts and gallbladder.